Clinical trial inclusion criterion:
Have a cervical dilation of 2 centimeters or less, measured at the level of the internal os

Annotated entities:
- Condition: "cervical dilation"
- Multiplier: "2 centimeters or less"
- Qualifier: "internal os"